Clinical trial exclusion criterion:
LA size > 50 mm (parasternal long axis view)

Entity relations:
- Has_qualifier("LA size", "parasternal long axis view")
- Has_value("LA size", "> 50 mm")